Clinical trial inclusion criterion:
Patients diagnosed at the out-patient cystoscopy with papillary bladder tumour will be legible for inclusion

Entity relations:
- AND("cystoscopy", "out-patient")